Severe hypernatraemia

The above is a clinical trial inclusion criterion. Annotated with entity spans:
[Qualifier: Severe] [Condition: hypernatraemia]